Clinical trial inclusion criterion:
1. Subject is at least 18 years old.

Annotated entities:
- Value: "at least 18 years"
- Person: "old"